Clinical trial inclusion criterion:
not pregnancy or breastfeeding

Entity relations:
- Has_negation("pregnancy", "not")
- OR("pregnancy", "breastfeeding")